Clinical trial inclusion criterion:
total bilirubin ≤ 1.5 x ULN (patients with Gilbert's syndrome total bilirubin ≤2.5 x ULN)

Entity relations:
- Has_value("total bilirubin", "≤ 1.5 x ULN")
- OR("total bilirubin", "Gilbert's syndrome")